The patients underwent chemotherapy, radiation therapy or targeted therapy(herceptin) after surgery according to the 2013 NCCN guideline.

The above is a clinical trial inclusion criterion. Annotated with entity spans:
The patients underwent [Procedure: chemotherapy], [Procedure: radiation therapy] or [Procedure: targeted therapy]([Drug: herceptin]) [Temporal: after surgery] according to the [Qualifier: 2013 NCCN guideline].